Fasting plasma glucose > 7,0 mM, HbA1c > 48 mmol/mol 3 months after RYGB

The above is a clinical trial exclusion criterion. Annotated with entity spans:
[Measurement: Fasting plasma glucose] [Value: > 7,0 mM], [Measurement: HbA1c] [Value: > 48 mmol/mol] [Temporal: 3 months after RYGB]